Clinical trial inclusion criterion:
18 years of age or older

Annotated entities:
- Value: "18 years or older"
- Person: "age"